Clinical trial inclusion criteria:
patients affected by mono-lateral symptomatic knee articular degenerative pathology with history of chronic (for at least 4 months) pain or swelling;
imaging findings of degenerative changes of the joint (osteoarthritis or chondropathy with Kellgren Lawrence Score from 0 to 3 at X-ray evaluation).

Annotated entities:
- Qualifier: "mono-lateral"
- Qualifier: "symptomatic"
- Condition: "knee articular degenerative pathology"
- Condition: "pain"
- Condition: "swelling"
- Temporal: "chronic"
- Temporal: "for at least 4 months"
- Procedure: "imaging"
- Condition: "degenerative changes"
- Condition: "osteoarthritis"
- Condition: "chondropathy"
- Measurement: "Kellgren Lawrence Score"
- Value: "from 0 to 3"
- Procedure: "X-ray"